¿Cuál de las siguientes frases sobre la infusión a velocidad constante de un fármaco es cierta?
1. La concentración alcanzada en estado de equilibrio estacionario depende exclusivamente del aclaramiento.
2. El tiempo necesario para alcanzar el estado de equilibrio estacionario depende del volumen de distribución.
3. La concentración alcanzada en estado de equilibrio estacionario depende exclusivamente de la semivida de eliminación.
4. La concentración alcanzada en el estado de equilibrio estacionario depende del aclaramiento y de la velocidad de infusión.
5. El tiempo necesario para alcanzar el estado de equilibrio estacionario depende del aclaramiento.

Respuesta correcta: 4. La concentración alcanzada en el estado de equilibrio estacionario depende del aclaramiento y de la velocidad de infusión.